Clinical trial exclusion criterion:
Unable to undergo MRI

Annotated entities:
- Condition: "Unable to undergo"
- Procedure: "MRI"